What is the mechanism of action of raxibacumab?

Raxibacumab is a recombinant human IgG1 monoclonal antibody that binds the protective antigen of Bacillus anthracis, thus blocking toxin effects.
It is approved to treat inhalational anthrax.